Clinical trial inclusion criterion:
Women (18-75 years) with suspected UTI

Annotated entities:
- Person: "Women"
- Person: "years"
- Value: "18-75"
- Condition: "UTI"
- Qualifier: "suspected"